Clinical trial exclusion criterion:
Subjects with a history of hypercoagulopathy, deep vein thrombosis (DVT), pulmonary embolism

Annotated entities:
- Condition: "hypercoagulopathy"
- Condition: "deep vein thrombosis"
- Condition: "DVT"
- Condition: "pulmonary embolism"
- Temporal: "history"